Clinical trial inclusion criterion:
Male and females between ages 18-85 years of age

Annotated entities:
- Person: "Male"
- Person: "females"
- Value: "between 18-85 years of age"
- Person: "ages"